腹主動脈（abdominal aorta）分枝為左右總腸骨動脈（common iliac artery）處，相當於下列那個體表位置？
A. 恥骨聯合上緣
B. 恥骨上緣與臍連線的中點
C. 臍
D. 橫幽門面（transpyloric plane）

正確答案：C. 臍